¿Cuál de los siguientes hidruros tiene el punto de ebullición normal más alto?
1. SiH4.
2. CH4.
3. HCl.
4. PH3.
5. HF.

Respuesta correcta: 5. HF.